Systolic blood pressure >=160 mm Hg OR a diastolic blood pressure of >=110 mm Hg measured twice more than 15 minutes apart

The above is a clinical trial inclusion criterion. Annotated with entity spans:
[Measurement: Systolic blood pressure] [Value: >=160 mm Hg] OR a [Measurement: diastolic blood pressure] of [Value: >=110 mm Hg] [Non-query-able: measured twice more than 15 minutes apart]